下列何種症狀或檢查和中腸扭結（Midgut volvulus）無關？
A. 血便
B. 貧血
C. 腹脹
D. 腹部 X 光攝影（plain abdomen）可用來確定診斷

正確答案：D. 腹部 X 光攝影（plain abdomen）可用來確定診斷